Serum creatinine > 1.5 mg/dL

The above is a clinical trial exclusion criterion. Annotated with entity spans:
[Measurement: Serum creatinine] [Value: > 1.5 mg/dL]